Las interacciones entre selectinas y diriginas vasculares:
1. Son muy fuertes.
2. Median la primera fase de la adhesión leucocito/endotelio.
3. Son permanentes.
4. Median la adhesión firme a los endotelios.
5. Son muy intensas en el bazo.

Respuesta correcta: 2. Median la primera fase de la adhesión leucocito/endotelio.